Clinical trial inclusion criteria:
Diagnosed with Beta-Thalassemia Major and receiving regular blood transfusion and on iron chelating therapy.
Weight: equal to or over 35 kg.
Normal renal function.

Annotated entities:
- Condition: "Beta-Thalassemia Major"
- Procedure: "blood transfusion"
- Qualifier: "regular"
- Procedure: "iron chelating therapy"
- Person: "Weight"
- Value: "equal to or over 35 kg"
- Condition: "renal function"
- Qualifier: "Normal"